Subjects were not to have donated plasma within 90 days prior to study initiation.

The above is a clinical trial exclusion criterion. Annotated with entity spans:
Subjects were [Negation: not] to have [Procedure: donated plasma] [Temporal: within 90 days prior to study initiation].